Male and females aged between 18 and 65 years of age inclusive, at the time of signing the informed consent.

The above is a clinical trial inclusion criterion. Annotated with entity spans:
[Person: Male] [Grammar_Error: and] [Person: females] [Person: aged] [Value: between 18 and 65 years] of [Person: age] inclusive, [Temporal: at the time of signing the informed consent].